Undergoing right upper extremity surgery with supraclavicular block as the primary anesthetic

The above is a clinical trial inclusion criterion. Annotated with entity spans:
[Temporal: Undergoing] [Procedure: right upper extremity surgery] with [Procedure: supraclavicular block] as the [Qualifier: primary anesthetic]